Clinically and angiographically stable CAD who requires CABG as part of the standard medical care, as CAD does not represent a contraindication for using liraglutide. The stability of the CAD further warranties that study patients will not be exposed to higher risk by using liraglutide

The above is a clinical trial inclusion criterion. Annotated with entity spans:
[Qualifier: Clinically] and [Qualifier: angiographically stable] [Condition: CAD] who [Mood: requires] [Procedure: CABG] as part of the standard medical care, [Non-representable: as CAD does not represent a contraindication for using liraglutide. The stability of the CAD further warranties that study patients will not be exposed to higher risk by using liraglutide]